Si las hormonas tiroideas están aumentadas y está disminuida tanto la TSH (hormona estimulante tiroidea) como la captación de yodo radiactivo por la glándula tiroides, se trata de un proceso de:
1. Tirotoxicosis no hipertiroidea.
2. Hipertiroidismo primario.
3. Hipertiroidismo hipofisario.
4. Enfermedad de Graves-Basedow.
5. Aumento de gonadotropinas.

Respuesta correcta: 1. Tirotoxicosis no hipertiroidea.